下列有關淋巴結（lymph node）的敘述，何者錯誤？
A. 淋巴結具纖維狀的被囊（capsule）
B. 淋巴結內的支架主要由彈性纖維（elastic fiber）構成
C. 淋巴結其凸狀面（convex）有輸入淋巴管（afferent lymph vessels）進入
D. 淋巴結實質（parenchyma）主要分為皮質（cortex）和髓質（medulla）

正確答案：B. 淋巴結內的支架主要由彈性纖維（elastic fiber）構成